35 歲女性，G2P2，妊娠 40 週生產時曾大量出血，產後 6 個月發現無乳汁，無月經，毛髮脫落，請問最可能的診斷為：
A. 庫欣症候群（Cushing's syndrome）
B. 希漢症候群（Sheehan's syndrome）
C. 強生症候群（Johnson syndrome）
D. 麥格症候群（Meige's syndrome）

正確答案：B. 希漢症候群（Sheehan's syndrome）